Have bleeding or clotting disorder

The above is a clinical trial exclusion criterion. Annotated with entity spans:
Have [Condition: bleeding] or [Condition: clotting disorder]